Clinical trial exclusion criterion:
4. significant coagulopathy( prothrombin time >15 seconds, INR>1.5

Annotated entities:
- Condition: "coagulopathy"
- Qualifier: "significant"
- Measurement: "prothrombin time"
- Value: ">15 seconds"
- Measurement: "INR"
- Value: ">1.5"